What effect does Methylsulfonylmethane (MSM) have on inflammation?

Methylsulfonylmethane (MSM) is an anti-inflammatory drug with anti-proinflammatory activity